La enzima succinato deshidrogenasa cataliza la reacción de deshidrogenación dependiente de:
1. NADPH.
2. FMN.
3. NAD+.
4. FAD.
5. CoA.

Respuesta correcta: 4. FAD.